Clinical trial inclusion criterion:
Women with a singleton pregnancy undergoing cesarean section after 37 weeks of gestation.

Annotated entities:
- Condition: "singleton pregnancy"
- Procedure: "cesarean section"
- Value: "after 37 weeks"
- Measurement: "gestation"